Contraindication to Clopidogrel

The above is a clinical trial exclusion criterion. Annotated with entity spans:
[Condition: Contraindication] to [Drug: Clopidogrel]